Clinical trial exclusion criterion:
Neurological brain disease and/or history of electroconvulsive therapy;

Annotated entities:
- Condition: "brain disease"
- Qualifier: "Neurological"
- Procedure: "electroconvulsive therapy"